52歲的陳先生因肺癌作右下肺葉切除後，術後照顧時需注意的最常見併發症是：
A. 痰積存導致肺泡萎陷（atelectasis）
B. 皮下氣腫（subcutaneous emphysema）
C. 膿胸（empyema）
D. 支氣管胸膜腔瘻管（bronchopleural fistula）

正確答案：A. 痰積存導致肺泡萎陷（atelectasis）